Clinical trial exclusion criterion:
2. CABG or Percutaneous Coronary Intervention (PCI) procedure;

Annotated entities:
- Procedure: "CABG"
- Procedure: "Percutaneous Coronary Intervention (PCI)"